下列有關肺癌 Gefitinib（EGFR tyrosine kinase inhibitor）之標的治療，何者有誤？
A. 對女性肺腺癌最為有效
B. 有 EGFR 突變者，治療效果較佳
C. 合併化學治療可提高療效
D. 在化學治療失敗之病例，仍具療效

正確答案：C. 合併化學治療可提高療效